Clinical trial exclusion criterion:
8. Unable to abstain from more than one beer or alcohol equivalent per day for the duration of the study

Annotated entities:
- Parsing_Error: "8."
- Non-query-able: "Unable to abstain from more than one beer or alcohol equivalent per day for the duration of the study"